Clinical trial exclusion criterion:
4. HbA1c > 9%

Entity relations:
- Has_value("HbA1c", "> 9%")